Clinical trial exclusion criterion:
communication or cognitive deficits with mini-mental state examination, (MMSE) <24/30 (Folstein et al., 1975);

Entity relations:
- Has_value("mini-mental state examination, (MMSE)", "<24/30")
- AND("communication deficits", "mini-mental state examination, (MMSE)")
- OR("communication deficits", "cognitive deficits")